Clinical trial inclusion criterion:
Age 18 to 80 years old

Entity relations:
- Has_value("Age", "18 to 80 years")